一位 60 歲男性病人，因貧血就診，大腸鏡發現上升結腸有腫瘤，切片病理報告為腺癌，電腦斷層檢查顯示無遠端轉移，經右半結腸切除發現腫瘤吃穿右結腸至結腸周圍脂肪組織，腸繫膜淋巴結， 顆中有 5 顆有癌細胞侵犯，故分期為 T3N2M0。術後會建議採何種措施？
A. 觀察
B. 用含 oxaliplatin/fluorouracil/leucovorin 的處方作輔助性化學治療
C. 用含 irinotecan/fluorouracil/leucovorin 的處方作輔助性化學治療
D. 用 fluorouracil/leucovorin 的處方作輔助性化學治療

正確答案：B. 用含 oxaliplatin/fluorouracil/leucovorin 的處方作輔助性化學治療